Clinical trial inclusion criterion:
Age between 18 and 65 years.

Annotated entities:
- Person: "Age"
- Value: "between 18 and 65 years"